Disease needing 2 injections of Therasphere

The above is a clinical trial exclusion criterion. Annotated with entity spans:
[Context_Error: Disease needing 2 injections of Therasphere]